下列何分子不會造成巨噬細胞活化？
A. IFN-γ（interferon-γ）
B. TNF-α（tumor necrosis factor-α）
C. IL-10（interleukin-10）
D. LPS（lipopolysaccharide）

正確答案：C. IL-10（interleukin-10）